Pouch stones

The above is a clinical trial exclusion criterion. Annotated with entity spans:
[Condition: Pouch stones]